Clinical trial inclusion criteria:
M. perstans mg-positive status Good general health without any clinical condition requiring long-term medication.
Normal renal and hepatic laboratory profiles

Annotated entities:
- Measurement: "M. perstans mg"
- Value: "positive"
- Condition: "Good general health"
- Condition: "clinical condition requiring long-term medication"
- Drug: "long-term medication"
- Qualifier: "requiring long-term medication"
- Undefined_semantics: "clinical condition requiring long-term medication"
- Negation: "without"
- Parsing_Error: "M. perstans mg-positive status Good general health without any clinical condition requiring long-term medication."
- Measurement: "hepatic laboratory profile"
- Value: "Normal"
- Measurement: "renal laboratory profile"